Clinical trial inclusion criterion:
Able to complete the Evaluation to Sign Consent (ESC) with minimum score of 80%

Annotated entities:
- Observation: "Able to complete"
- Procedure: "Evaluation to Sign Consent (ESC)"
- Value: "minimum score of 80%"